Clinical trial inclusion criterion:
Creatinen in blood = 3mg/dl

Annotated entities:
- Measurement: "Creatinen"
- Value: "= 3mg/dl"